What is the cause of Phthiriasis Palpebrarum?

Phthiriasis palpebrarum is a rare eyelid infestation caused by phthirus pubis.